Para el análisis de trazas de constituyentes inorgánicos, en muestras de naturaleza orgánica, se necesita un tratamiento previo de la muestra que consiste normalmente en:
1. Disolver la muestra en agua fría.
2. Disolver la muestra en agua caliente.
3. Disolver la muestra entre 30 y 70 ºC.
4. Calentar la muestra entre 400 y 700 ºC.
5. Calentar la muestra en ácido clorhídrico 0.1 M.

Respuesta correcta: 4. Calentar la muestra entre 400 y 700 ºC.